Clinical trial exclusion criterion:
Visible skin pathology, excessive freckles, or skin blemishes in the test area.

Entity relations:
- Has_qualifier("freckles", "excessive")
- OR("skin pathology", "skin blemishes", "freckles")